Clinical trial exclusion criterion:
Multiple (> 1) bites

Entity relations:
- Subsumes("Multiple", "> 1")
- Has_multiplier("bites", "Multiple")